Level of SCI C3-T1, AIS A & B;

The above is a clinical trial inclusion criterion. Annotated with entity spans:
[Measurement: Level of SCI] [Value: C3-T1], [Measurement: AIS] [Value: A & B];